Clinical trial exclusion criterion:
Considered as a candidate for curative therapy

Annotated entities:
- Procedure: "curative therapy"